All children scheduled for outpatient MRI scans with expected duration of scan between 30 minutes and 75 minutes.

The above is a clinical trial inclusion criterion. Annotated with entity spans:
All children scheduled for [Qualifier: outpatient] [Procedure: MRI scans] with [Measurement: expected duration of scan] [Value: between 30 minutes and 75 minutes].